有關營養素的吸收之敘述，下列何者錯誤？
A. 蛋白質，須分解成胺基酸才能吸收
B. 麥芽糖，須分解成單醣才能吸收
C. 脂肪，須分解成單一脂肪酸才能吸收
D. 乳糖，分解成半乳糖及葡萄糖，才能吸收

正確答案：A. 蛋白質，須分解成胺基酸才能吸收